Clinical trial exclusion criterion:
Allergic reaction upon erythropoietin

Annotated entities:
- Condition: "Allergic"
- Drug: "erythropoietin"